巨大細胞血管炎（giant cell arteritis），常與下列何種疾病共同發生？
A. rheumatoid arthritis
B. Sjögren's syndrome
C. polymyalgia rheumatica
D. primary biliary cirrhosis

正確答案：C. polymyalgia rheumatica